有位八歲輕微智障之男孩，被診斷有自閉症傾向，理學檢查發現雙側睪丸皆較同齡兒童為大，耳朵外觀正常但比同齡兒童大，語言發展也有障礙。此兒童最有可能是下列何疾病？
A. 唐氏症（Down syndrome）
B. 透納氏症（Turner syndrome）
C. 易脆型染色體 X 症候群（Fragile X syndrome）
D. 苯酮酸尿症（phenylketonuria）

正確答案：C. 易脆型染色體 X 症候群（Fragile X syndrome）